Known active brain metastases

The above is a clinical trial exclusion criterion. Annotated with entity spans:
Known [Qualifier: active] [Condition: brain metastases]